En los pacientes que presentan Enfermedad Pulmonar Obstructiva Crónica, qué tratamientos de los que figuran a continuación están contraindicados por el efecto que provocan:
1. Broncodilatadores, tanto de acción corta como larga.
2. Mucolíticos y expectorantes para reducir la viscosidad de las secreciones.
3. Oxígeno que a largo plazo reduce la mortalidad del enfermo con EPOC.
4. Depresores respiratorios como opioides y barbitúricos.
5. Antibióticos para pacientes con infecciones pulmonares de repetición.

Respuesta correcta: 4. Depresores respiratorios como opioides y barbitúricos.